Exclusion criteria for MRI: having metal in the body and/or having claustrophobia

The above is a clinical trial exclusion criterion. Annotated with entity spans:
[Condition: Exclusion criteria for MRI]: having [Device: metal in the body] and/or having [Condition: claustrophobia]